Clinical trial inclusion criterion:
has practiced adequate contraception for 30 days prior to vaccination, and

Entity relations:
- Has_qualifier("contraception", "adequate")
- Has_temporal("contraception", "30 days prior to vaccination")
- Has_index("30 days prior to vaccination", "vaccination")